1. Women of childbearing potential must have negative serum (Beta HCG) pregnancy tests performed within 14 days prior to the start of the study and on the evening prior to each dose administration. If dosing is scheduled on Sunday or Monday, the HCG pregnancy test should be given within 48 hours prior to dosing of each study period. An additional serum (Beta HCG) pregnancy test will be performed upon completion of the study.

The above is a clinical trial inclusion criterion. Annotated with entity spans:
1. [Person: Women] of [Condition: childbearing potential] must have [Value: negative] [Procedure: serum] ([Procedure: Beta HCG]) pregnancy tests performed [Temporal: within 14 days prior to the start of the study] and [Temporal: on the evening prior to each dose administration]. If dosing is scheduled on Sunday or Monday, the HCG pregnancy test should be given within 48 hours prior to dosing of each study period. An additional serum (Beta HCG) pregnancy test will be performed upon completion of the study.